Clinical trial exclusion criterion:
Patients will be excluded if they could not tolerate MET during the recommended titration schedule outlined in the protocol;

Annotated entities:
- Condition: "not tolerate"
- Drug: "MET"